Evidence of disease progression

The above is a clinical trial inclusion criterion. Annotated with entity spans:
[Subjective_judgement: Evidence of disease progression]